Presentation of moderate to severe depressive symptoms (Montgomery-Asberg Rating Scale: MADRS = 18 at time of study entry or = 24 at any time during study)

The above is a clinical trial inclusion criterion. Annotated with entity spans:
Presentation of [Qualifier: moderate to severe] [Condition: depressive symptoms] ([Measurement: Montgomery-Asberg Rating Scale]: [Measurement: MADRS] [Value: = 18] [Temporal: at time of study entry] or [Value: = 24] [Temporal: at any time during study])